Clinical trial inclusion criterion:
No more than 20 wk of gestation

Annotated entities:
- Value: "No more than 20 wk"
- Measurement: "gestation"
- Condition: "gestation"